喉軟化症（laryngomalacia）的症狀通常發生於何時？
A. 出生立即發生
B. 出生後數週
C. 出生後半年
D. 出生後一年

正確答案：B. 出生後數週